社會流行病學強調疾病多層次的社會機制，研究設計時常需同時考慮「個體」與「群體」分析單位。此種同時考慮「個體」與「群體」的研究設計，可以避免下述何種研究上的謬誤或偏誤？
A. 辛普森詭論（Simpson's paradox）
B. 生態謬誤（ecological fallacy）
C. 選擇偏誤（selection bias）
D. 干擾偏誤（confounding bias）

正確答案：B. 生態謬誤（ecological fallacy）